¿El déficit de cuál de las siguientes enzimas NO es causa de porfiria?:
1. Protoporfirinógeno oxidasa.
2. Delta-amino levulínico sintetasa.
3. Coproporfirinógeno III oxidasa
4. Uroporfirinógeno descarboxilasa.
5. Uroporfirinógeno III cosintetasa.

Respuesta correcta: 2. Delta-amino levulínico sintetasa.